The participant has severe dyskinesia.

The above is a clinical trial exclusion criterion. Annotated with entity spans:
The participant has [Qualifier: severe] [Condition: dyskinesia].